Clinical trial inclusion criterion:
Periodontal parameters : Depth Probing (PS), Visible Plaque Index (IPV), Gingival Index (GI) and Probing Bleed Index (SS). The normal included were: PS = 1 to 3 mm, GI = 0, IPV = score 0 e SS = score 0.

Entity relations:
- Has_value("PS", "= 1 to 3 mm")
- Has_value("GI", "= 0")
- Has_value("IPV", "score 0")
- Has_value("SS", "score 0")
- AND("Depth Probing (PS)", "PS")
- OR("GI", "SS", "IPV")
- OR("Depth Probing (PS)", "Probing Bleed Index (SS)", "Visible Plaque Index (IPV)", "Gingival Index (GI)")